Recently suffered from MI or CVA.

The above is a clinical trial exclusion criterion. Annotated with entity spans:
[Temporal: Recently] suffered from [Condition: MI] or [Condition: CVA].